Clinical trial exclusion criteria:
patient already treated by medicines which could interfere with the study
low level of vitamin B12 and folate which are considered as clinically relevant
clinically relevant pathologies (eg: pulmonary illness, cardiovascular illness; evolutive cancer, neurological illness, blood illness….)

Annotated entities:
- Context_Error: "patient already treated by medicines which could interfere with the study"
- Measurement: "level of vitamin B12"
- Value: "low"
- Measurement: "folate level of"
- Condition: "pulmonary illness"
- Condition: "cardiovascular illness"
- Condition: "evolutive cancer"
- Condition: "neurological illness"
- Condition: "blood illness"
- Context_Error: "clinically relevant pathologies (eg: pulmonary illness, cardiovascular illness; evolutive cancer, neurological illness, blood illness….)"